Acute coronary syndrome in the past 6 months

The above is a clinical trial exclusion criterion. Annotated with entity spans:
[Condition: Acute coronary syndrome] [Temporal: in the past 6 months]